下列何者不是發源於神經嵴（neural crest）？
A. 黑色素細胞（melanocyte）
B. 許旺氏細胞（Schwann cell）
C. 寡突膠質細胞（oligodendrocyte）
D. 嗜鉻細胞（chromaffin cell）

正確答案：C. 寡突膠質細胞（oligodendrocyte）